Clinical trial exclusion criterion:
Diabetes mellitus or other systemic illness

Annotated entities:
- Condition: "Diabetes mellitus"
- Condition: "systemic illness"